在目前最先進的治療下，下列何種小兒癌症有最好的預後？
A. medulloblastoma in posterior fossa
B. neuroblastoma stage 4S
C. advanced anaplastic large cell lymphoma
D. anaplastic stage IV Wilms tumor

正確答案：B. neuroblastoma stage 4S